聚合酶鏈鎖反應（polymerase chain reaction）過程的先後順序為何？①DNA 延伸（extension）  ②DNA 變性（denaturation） ③引子與 DNA 模板結合（annealing）
A. ①③②
B. ②①③
C. ②③①
D. ①②③

正確答案：C. ②③①